BMI = 40 kg/m2.

The above is a clinical trial inclusion criterion. Annotated with entity spans:
[Measurement: BMI] [Value: = 40 kg/m2].